Clinical trial exclusion criterion:
With severe cardiovascular disease, or mental

Annotated entities:
- Condition: "cardiovascular disease"
- Condition: "disease mental"
- Qualifier: "severe"